Clinical trial inclusion criterion:
25-50 years of age

Annotated entities:
- Person: "age"
- Value: "25-50 years"